La insulina regula la síntesis de ácidos grasos:
1. Activando la fosforilasa.
2. Desfosforilando la acetil CoA carboxilasa.
3. Inhibiendo la formación de malonil CoA.
4. Controlando la actividad carnitina-acil CoA transferasa.
5. Activando la ácido graso sintetasa.

Respuesta correcta: 2. Desfosforilando la acetil CoA carboxilasa.